下列有關腦性麻痺的敘述，何者最為正確？
A. 腦性麻痺兒童一定會合併智能障礙
B. 最常見的為低張力型（hypotonia）
C. 大多數偏癱性腦性麻痺（hemiplegic type）的兒童無法走路
D. 由高膽紅質血症所造成徐動型（athetoid type）的病患較易合併聽力障礙的問題

正確答案：D. 由高膽紅質血症所造成徐動型（athetoid type）的病患較易合併聽力障礙的問題